Subjects were to have no clinically significant abnormal findings on physical examination, ECG, medical history, or clinical laboratory results during screening.

The above is a clinical trial inclusion criterion. Annotated with entity spans:
Subjects were to have [Negation: no] [Qualifier: clinically significant] [Condition: abnormal findings] on [Procedure: physical examination], [Procedure: ECG], [Temporal: medical history], or [Procedure: clinical laboratory] results [Temporal: during screening].